What is the drug Tecfidera used against?

Tecifidera is approved for the treatment of relapsing-remitting multiple sclerosis.